Clinical trial inclusion criterion:
CHB patients who had received NAs for more than 12 months.

Entity relations:
- AND("CHB", "NAs")
- Has_temporal("NAs", "more than 12 months.")